¿Cuál de las siguientes acciones NO es propia de la prolactina?
1. Favorece la retención renal de agua y sal.
2. Favorece que se mantenga el cuerpo lúteo.
3. Estimula la producción de leche.
4. Estimula la secreción hipotalámica de la hormona liberadora de gonadotrofina.
5. Participa en el control de la espermatogénesis.

Respuesta correcta: 4. Estimula la secreción hipotalámica de la hormona liberadora de gonadotrofina.